History or other evidence of severe retinopathy (e.g. CMV retinitis, macula degeneration) or clinically relevant ophthalmological disorder due to diabetes mellitus or hypertension

The above is a clinical trial exclusion criterion. Annotated with entity spans:
History or other evidence of [Qualifier: severe] [Condition: retinopathy] (e.g. [Condition: CMV retinitis], [Condition: macula degeneration]) or [Qualifier: clinically relevant] [Condition: ophthalmological disorder] due to [Condition: diabetes mellitus] or [Condition: hypertension]